Clinical trial exclusion criterion:
Patients with preeclampsia,

Annotated entities:
- Condition: "preeclampsia"